一位50歲男性至急診求治，主訴下巴紅腫疼痛，舌頭向後移位，下列敘述何者最不恰當？
A. Ludwig's angina 是可能的鑑別診斷
B. 病人可因蛀牙或口腔未保持清潔所引起
C. 可給口服抗生素後門診追蹤
D. 可使用電腦斷層進行診斷

正確答案：C. 可給口服抗生素後門診追蹤